Clinical trial inclusion criterion:
Capable of giving signed informed consent which includes compliance with the requirements and restrictions listed in the consent form and protocol.

Annotated entities:
- Informed_consent: "Capable of giving signed informed consent which includes compliance with the requirements and restrictions listed in the consent form and protocol."